Clinical trial inclusion criterion:
patients with renal cancer coming to the laparoscopic radical nephrectomy

Entity relations:
- Has_qualifier("radical nephrectomy", "laparoscopic")